History of allergic reactions attributed to compounds of similar chemical or biologic composition to misoprostol

The above is a clinical trial exclusion criterion. Annotated with entity spans:
[Temporal: History] of [Condition: allergic reactions] attributed to [Drug: compounds of similar chemical or biologic composition to misoprostol]